Clinical trial inclusion criterion:
Type 2 diabetes mellitus with HbA1c > 7.5 %

Annotated entities:
- Condition: "Type 2 diabetes mellitus"
- Measurement: "HbA1c"
- Value: "> 7.5 %"